Clinical trial exclusion criterion:
pregnant or breast feeding

Entity relations:
- OR("pregnant", "breast feeding")